一名 8 天大男嬰因黃疸及餵食減少而就醫，在詢問病史時得知這是母親的第一胎，為純母乳哺餵，母親血型為 A 型，寶寶為 B 型，這兩天寶寶膚色越來越黃且極度嗜睡，很難將他叫醒哺乳，幫寶寶換尿布時發現尿布幾乎都是乾的。下列臨床處置，何者對此男嬰最合宜？
A. 給予母親如何哺餵母乳的衛教後，安排一週後門診追蹤
B. 安排住院並立即準備 B 型血，進行換血治療
C. 安排住院做血液檢查並給予靜脈輸液注射以補充水分
D. 安排儘快住院做脊髓穿刺，取 CSF 做檢查後立即給予抗生素

正確答案：C. 安排住院做血液檢查並給予靜脈輸液注射以補充水分